Clinical trial exclusion criterion:
structural and functional urogenital abnormalities, that predispose for urogenital infections

Entity relations:
- Has_qualifier("urogenital abnormalities", "structural")
- multi("predispose for urogenital infections", "urogenital infections")
- OR("structural", "functional")